Clinical trial exclusion criterion:
intracranial surgery

Annotated entities:
- Procedure: "intracranial surgery"